ketoacidosis with a Base Excess >=2

The above is a clinical trial exclusion criterion. Annotated with entity spans:
[Condition: ketoacidosis] with a [Measurement: Base Excess] [Value: >=2]